White Brazilian of European descent

The above is a clinical trial inclusion criterion. Annotated with entity spans:
[Person: White] [Person: Brazilian] of [Person: European descent]